Clinical trial exclusion criterion:
Patients who have coma, convulsion or paralysis due to intracranial hemorrhage or central nervous system leukemia at diagnosis.

Entity relations:
- Has_qualifier("leukemia", "central nervous system")
- Has_temporal("intracranial hemorrhage", "at diagnosis")
- AND("coma", "intracranial hemorrhage")
- OR("intracranial hemorrhage", "leukemia")
- OR("coma", "paralysis", "convulsion")